Clinical trial inclusion criterion:
Children, aged between one and 24 months. classified as (American Society of Anesthesiologists) ASA physical status I or II, undergoing TEE were enrolled in the study.

Entity relations:
- Has_value("aged", "between one and 24 months")
- Subsumes("ASA physical status", "American Society of Anesthesiologists")
- Has_value("ASA physical status", "I or II")